testosterone 在代謝過程中經過何者之作用轉化成 estradiol？
A. 5α-reductase
B. cytochrome P450s
C. 3β-hydroxy steroid dehydrogenase
D. aromatase

正確答案：D. aromatase